Clinical trial inclusion criterion:
Written informed consent signed by patient.

Annotated entities:
- Post-eligibility: "ritten informed consent signed by patient"